Los islotes de Langerhans del páncreas secretan y liberan:
1. Colecistoquinina.
2. Insulina y glucagón.
3. Vasopresina.
4. Adrenalina y noradrenalina.
5. Prolactina.

Respuesta correcta: 2. Insulina y glucagón.